Clinical trial inclusion criterion:
The patient was confirmed to have a history of gastric ulcer or duodenal ulcer.

Entity relations:
- Has_temporal("gastric ulcer", "history")
- OR("gastric ulcer", "duodenal ulcer")